No antibiotic treatment in the last 2 weeks

The above is a clinical trial inclusion criterion. Annotated with entity spans:
[Negation: No] [Drug: antibiotic treatment] [Temporal: in the last 2 weeks]